Age range: 7 to 14 years-old;

The above is a clinical trial inclusion criterion. Annotated with entity spans:
[Person: Age] range: [Value: 7 to 14 years-old];